Endometriosis.

The above is a clinical trial exclusion criterion. Annotated with entity spans:
[Condition: Endometriosis].